Clinical trial exclusion criteria:
Patient has been permanently discontinued from nilotinib treatment in the parent study due to unacceptable toxicity, non-compliance to study procedures, withdrawal of consent or any other reason
Patient has participated in a Novartis sponsored combination trial where nilotinib was dispensed in combination with another study medication and patient is still receiving combination therapy
Patients who are currently receiving treatment with any medications that have the potential to prolong the QT interval or inducing Torsade de Pointes and the treatment cannot be either safely discontinued at least one week prior to nilotinib treatment or switched to a different medication prior to start of nilotinib treatment and for the duration of the study
Pregnant or nursing (lactating) women, where pregnancy is defined as the state of a female after conception and until the termination of gestation, confirmed by a positive hcG laboratory test.
Women of child-bearing potential, defined as all women physiologically capable of becoming pregnant, unless they are using highly effective methods of contraception during the study and for 30 days after the final dose of nilotinib.

Annotated entities:
- Negation: "discontinued"
- Multiplier: "permanently"
- Drug: "nilotinib"
- Procedure: "treatment"
- Condition: "unacceptable toxicity"
- Observation: "non-compliance"
- Procedure: "study procedures"
- Negation: "withdrawal"
- Observation: "consent"
- Observation: "any other reason"
- Qualifier: "Novartis sponsored"
- Observation: "participated in a combination trial"
- Non-representable: "Patient has participated in a Novartis sponsored combination trial where nilotinib was dispensed in combination with another study medication and patient is still receiving combination therapy"
- Procedure: "treatment"
- Temporal: "currently"
- Drug: "any medications"
- Qualifier: "have the potential to prolong the QT interval"
- Qualifier: "inducing Torsade de Pointes"
- Non-representable: "the treatment cannot be either safely discontinued at least one week prior to nilotinib treatment or switched to a different medication prior to start of nilotinib treatment and for the duration of the study"
- Observation: "Pregnant"
- Observation: "nursing"
- Person: "women"
- Observation: "lactating"
- Observation: "hcG laboratory test"
- Value: "positive"
- Person: "Women"
- Observation: "child-bearing potential"
- Observation: "physiologically capable of becoming pregnant"
- Person: "women"
- Negation: "unless"
- Qualifier: "highly effective methods"
- Observation: "contraception"
- Temporal: "during the study"
- Temporal: "for 30 days after the final dose of nilotinib"
- Reference_point: "the final dose of nilotinib"